Diagnosis of dyslipidemia: The existence of a previous clinical diagnostic of dyslipidemia associated with lipid-lowering therapy. It is also considered patients who have an altered analytical, using the following cutoffs: total cholesterol = 200 mg / dl, triglycerides = 180 mg / dl, HDL-cholesterol = 40 mg / dl or LDL-cholesterol = 150 mg / dl. Lipid-lowering treatment and diet, stable in the last month.

The above is a clinical trial inclusion criterion. Annotated with entity spans:
Diagnosis of [Condition: dyslipidemia]: The existence of a previous clinical diagnostic of [Condition: dyslipidemia] associated with [Procedure: lipid-lowering therapy]. It is also considered patients who have an [Condition: altered analytical], using the following cutoffs: [Measurement: total cholesterol] [Value: = 200 mg / dl], [Measurement: triglycerides] [Value: = 180 mg / dl], [Measurement: HDL-cholesterol] [Value: = 40 mg / dl] or [Measurement: LDL-cholesterol] [Value: = 150 mg / dl]. [Procedure: Lipid-lowering treatment] and diet, [Qualifier: stable] [Temporal: in the last month].